What is the nucleotide composition of the Lamin Associated Domains (LADs)?

Constitutive nuclear lamina-genome interactions are highly conserved and associated with A/T-rich sequence.